治療下肢深部靜脈血栓症（Deep vein thrombosis）及其併發症，下列何種治療方式目前最少被使用？
A. 血栓的外科切除（Thrombectomy）
B. 血栓溶解治療（Thrombolysis）
C. 下腔靜脈過濾器（Vena cava filter）
D. 抗凝血藥劑治療（Anticoagulant therapy）

正確答案：A. 血栓的外科切除（Thrombectomy）